Clinical trial inclusion criterion:
Corneal staining < grade III on the Oxford scale

Annotated entities:
- Condition: "Corneal staining"
- Qualifier: "< grade III"
- Qualifier: "Oxford scale"
- Qualifier: "Oxford scale"